Clinical trial inclusion criterion:
Normal Hormonal investigation: TSH,PRL,FBS

Entity relations:
- Has_qualifier("Hormonal investigation", "Normal")
- Subsumes("Hormonal investigation", "TSH")
- Subsumes("Hormonal investigation", "PRL")
- Subsumes("Hormonal investigation", "FBS")